Uno de los principales factores de riesgo para el cáncer renal es:
1. Cardiopatía sin tratamiento.
2. Sexo.
3. Insuficiencia hepática.
4. Ingesta de alcohol.
5. Enfermedad renal poliquística.

Respuesta correcta: 5. Enfermedad renal poliquística.